Las aminoacil-tRNA sintetasas:
1. Participan en la síntesis de los tRNAs.
2. Participan en la maduración de los precursores de los tRNAs.
3. Son responsables de la síntesis de los aminoácidos.
4. Son responsables de la interpretación del código genético.
5. Sintetizan partes de los ribosomas.

Respuesta correcta: 4. Son responsables de la interpretación del código genético.